Clinical trial inclusion criterion:
Have at least one cardiovascular risk factor (eg, current smoker, high blood pressure, high cholesterol levels, diabetes mellitus, history of heart attack, family history of coronary heart disease, extra-articular RA disease)

Entity relations:
- Has_multiplier("cardiovascular risk factor", "at least one")
- Has_temporal("heart attack", "history")
- Has_qualifier("RA disease", "extra-articular")
- Has_temporal("smoker", "current")
- Has_context("coronary heart disease", "family history")
- Subsumes("cardiovascular risk factor", "smoker")
- OR("smoker", "high blood pressure", "high cholesterol levels", "diabetes mellitus", "heart attack", "coronary heart disease", "RA disease")